Clinical trial exclusion criterion:
Simultaneous participation in another interventional clinical trial (drugs or medical devices studies)

Annotated entities:
- Non-query-able: "Simultaneous participation in another interventional clinical trial (drugs or medical devices studies)"